Clinical trial exclusion criterion:
13. Mobitz Type II or III° atrial ventricular block，severe ventricular arrhythmia (polymorphic and frequent premature ventricular beats, frequent non-sustained ventricular tachycardia);

Entity relations:
- Has_value("Mobitz", "Type II or III")
- AND("atrial ventricular block", "Mobitz")
- Has_qualifier("ventricular arrhythmia", "severe")
- Has_qualifier("ventricular tachycardia", "non-sustained")
- Has_multiplier("ventricular tachycardia", "frequent")
- Has_multiplier("premature ventricular beats", "frequent")
- Has_qualifier("premature ventricular beats", "polymorphic")
- Subsumes("ventricular arrhythmia", "premature ventricular beats")
- Subsumes("ventricular arrhythmia", "ventricular tachycardia")
- OR("atrial ventricular block", "ventricular arrhythmia")